Platelets < 75 x 109 cells/L.

The above is a clinical trial exclusion criterion. Annotated with entity spans:
[Measurement: Platelets] [Value: < 75 x 109 cells/L].